Los compuesto organometálicos son derivados:
1. Con carácter radicalario.
2. Con enlaces covalentes entre átomos de carbono y átomos de metal.
3. Con déficit electrónico y carácter electrofílico.
4. Prácticamente no reactivos.
5. Con carácter esencialmente reductor.

Respuesta correcta: 2. Con enlaces covalentes entre átomos de carbono y átomos de metal.